scheduled for elective cesarean delivery

The above is a clinical trial inclusion criterion. Annotated with entity spans:
[Mood: scheduled for] [Qualifier: elective] [Procedure: cesarean delivery]